Subject suffers from any condition, such as swallowing problems, that precludes compliance with study and/or device instructions.

The above is a clinical trial exclusion criterion. Annotated with entity spans:
Subject suffers from any [Condition: condition], such as [Condition: swallowing problems], that [Negation: precludes] [Informed_consent: compliance with study] and/or device instructions.